Clinical trial exclusion criterion:
Hemodynamic or respiratory instability requiring inotropic support, mechanical ventilation or mechanical heart assistance within 30 days of screening evaluation.

Entity relations:
- Has_index("within 30 days of screening evaluation", "screening evaluation")
- Has_temporal("inotropic support", "within 30 days of screening evaluation")
- AND("Hemodynamic instability", "inotropic support")
- OR("Hemodynamic instability", "respiratory instability")
- OR("inotropic support", "mechanical ventilation", "mechanical heart assistance")